Adult men who have sex with men, and transgender women

The above is a clinical trial inclusion criterion. Annotated with entity spans:
[Person: Adult] [Person: men who have sex with men], and [Person: transgender women]